Clinical trial exclusion criterion:
Pregnancy or lactation

Entity relations:
- OR("Pregnancy", "lactation")